眼底檢查發現牛眼狀黃斑病變（bull's eye maculopathy），常與下列何種疾病相關？
A. 氯奎寧視網膜病變（chloroquine retinopathy）
B. 囊狀黃斑部水腫（cystoid macular edema）
C. 中央視網膜動脈阻塞（central retinal artery occlusion）
D. 老年性黃斑病變（age-related macular degeneration）

正確答案：A. 氯奎寧視網膜病變（chloroquine retinopathy）